Clinical trial inclusion criterion:
children and teenagers aged less than 20 years,

Entity relations:
- Has_value("aged", "less than 20 years")
- OR("children", "teenagers")